一位45歲的中年男性，職業為長途大客車司機，近期常患眩暈，嚴重時天旋地轉無法站立。 此眩暈已數次在其開車中發生，造成危險。適逢公司舉行年度體檢時，醫師診斷為內耳疾病，短期內無法完全治癒，須好好休息。唯病人為負擔家計，拒絕接受治療，並要求醫師對公司保密。醫師是否應告知雇主此病人的情況？
A. 是。此時乘客生命安全與公共利益比保密更重要
B. 否。保密原則不允許醫師有任何違反的權利
C. 否。醫師應轉介給其他醫師
D. 是。雇主可以知道員工生活上的隱私

正確答案：A. 是。此時乘客生命安全與公共利益比保密更重要